Patients who do not agree to the proposed treatment or will receive (part of) the treatment in a non-participating centre

The above is a clinical trial exclusion criterion. Annotated with entity spans:
Patients who do [Negation: not] [Observation: agree to the proposed treatment] or will receive (part of) the [Procedure: treatment] in a [Visit: non-participating centre]